Clinical trial inclusion criterion:
Absolute neutrophil count (ANC) >= 1250/ul

Entity relations:
- Subsumes("Absolute neutrophil count", "ANC")
- Has_value("Absolute neutrophil count", ">= 1250/ul")